El tratamiento psicológico del trastorno de ansiedad generalizada centrado en el abordaje de las creencias negativas sobre las preocupaciones (p.e., que las preocupaciones son incontrolables) y de las creencias positivas disfuncionales sobre la utilidad de preocuparse (p.e., que la preocupación mejora los resultados) se conoce como:
1. Terapia de regulación de las emociones.
2. Terapia metacognitiva.
3. Terapia conductual basada en la aceptación.
4. Terapia integradora.
5. Terapia de conciencia somática.

Respuesta correcta: 2. Terapia metacognitiva.